Clinical trial exclusion criterion:
Patients are not expected to be alive for longer than 3 months.

Entity relations:
- Has_value("expected to be alive", "longer than 3 months")
- Has_negation("expected to be alive", "not")